Clinical trial exclusion criterion:
Presence of implanted ICD/CRT-D.

Annotated entities:
- Device: "implanted ICD/CRT-D"